黃先生 32 歲，剛被診斷為重症肌無力症。他的胸部 X 光和電腦斷層檢查發現前縱膈腔有一分界清楚的病灶。有關此病灶，下列何者是最可能的診斷？
A. 淋巴瘤
B. 胸腺瘤
C. 甲狀腺結節
D. Castleman's disease

正確答案：B. 胸腺瘤